一位 45 歲男性，有糖尿病及糖尿病腎病變之病史，診斷為社區型肺炎（Community-acquired pneumonia）而住院。血液檢查如下：白血球 15200/mm3（中性白血球占 85%，淋巴球占 12%）、肌酐酸 3.5 mg/dL。 對於此病患的治療，最好不要選擇使用下列那一種抗生素？
A. Moxifloxacin
B. Ceftriaxone
C. Ampicillin-Sulbactam + clarithromycin
D. Cefuroxime + Gentamicin

正確答案：D. Cefuroxime + Gentamicin